受測者被照射右眼，其右眼瞳孔收縮，但左眼瞳孔不收縮。由此瞳孔光反射（pupillary light reflex）可以確知：
A. 其左邊之第三顱神經傳導功能不健全
B. 其右眼視神經（optic nerve）感光功能健全
C. 其中腦（midbrain）內之左 Edinger-Westphal 神經核功能不健全
D. 其左眼視神經感光功能健全

正確答案：B. 其右眼視神經（optic nerve）感光功能健全